Serious or unstable medical or psychological conditions that would compromise the subject's safety for successful participation

The above is a clinical trial exclusion criterion. Annotated with entity spans:
[Non-query-able: Serious or unstable medical or psychological conditions that would compromise the subject's safety for successful participation]